Clinical trial exclusion criterion:
11. Stroke or transient ischemic attack within the prior 3 months.

Annotated entities:
- Condition: "Stroke"
- Condition: "transient ischemic attack"
- Temporal: "within the prior 3 months"